Clinical trial exclusion criterion:
Currently taking anticoagulants, other than aspirin, unless the patient can be taken off the anticoagulant for surgery.

Entity relations:
- Has_negation("aspirin", "other than")
- AND("anticoagulants", "aspirin")